Clinical trial exclusion criterion:
Therapy area was previously received isotope or PDT or other treatment which might interfere with the efficacy evaluation;

Entity relations:
- Has_qualifier("treatment", "might interfere with the efficacy evaluation")
- AND("treatment", "isotope")
- OR("isotope", "PDT")